Clinical trial inclusion criterion:
Experience with pump-assisted infusions of IgPro20 at tolerated volumes of 25 mL/injection site for at least 1 month prior to Day 1.

Entity relations:
- Has_index("for at least 1 month prior to Day 1", "Day 1")
- Has_qualifier("volumes of 25 mL/injection site", "tolerated")
- Has_multiplier("IgPro20", "volumes of 25 mL/injection site")
- Has_temporal("IgPro20", "for at least 1 month prior to Day 1")
- Has_qualifier("IgPro20", "pump-assisted infusions")